根據佛洛依德的心性發展（psychosexual development）理論，在 3～5 歲的幼童處於那一個發展階段？
A. 口慾期（oral stage）
B. 肛門期（anal stage）
C. 性蕾期（phallic stage）
D. 潛伏期（latency stage）

正確答案：C. 性蕾期（phallic stage）